Clinical trial inclusion criterion:
Medical examination performed prior to participation in research

Entity relations:
- Has_temporal("Medical examination", "prior to participation in research")